在人類，豬囊尾幼蟲（Cysticercus cellulosae）最常侵犯下列何處？
A. 眼睛
B. 腦
C. 小腸
D. 肝臟

正確答案：B. 腦